Clinical trial exclusion criterion:
Chemotherapy or radiation within 3 weeks of the first scheduled study treatment.

Annotated entities:
- Drug: "Chemotherapy"
- Procedure: "radiation"
- Temporal: "within 3 weeks of the first scheduled study treatment"
- Reference_point: "the first scheduled study treatment"